王小姐，28 歲，產後為了減肥，不吃早餐，兩個月下來體重減輕了十公斤，心中還暗喜減肥有成，平常除了看起來清瘦倒沒有什麼不適，但近來每天早上十點多鐘上街買菜均出現類似恐慌發作之現象，出現冷汗、發抖、呼吸加快，好像快要死掉一般，則王小姐最可能的診斷為：
A. 產後憂鬱症
B. 恐慌症
C. 低血糖症
D. 甲狀腺功能過高

正確答案：C. 低血糖症